腎細胞癌（renal cell carcinoma）的細胞型態，最常見的是：
A. 嗜酸粒細胞瘤（oncocytomas）
B. 難染細胞（chromophobe）型
C. 乳突（papillary）型
D. 透亮細胞（clear cell）型

正確答案：D. 透亮細胞（clear cell）型